Clinical trial exclusion criterion:
A diagnosis of sleep disordered breathing;

Annotated entities:
- Condition: "sleep disordered breathing"